Currently or has recently received radiotherapy or chemotherapy, adrenocorticotropic hormone (ACTH), corticosteroids, or immunosuppressive drugs.

The above is a clinical trial exclusion criterion. Annotated with entity spans:
Currently or has [Temporal: recently] received [Procedure: radiotherapy] or [Procedure: chemotherapy], [Drug: adrenocorticotropic hormone] ([Drug: ACTH]), [Drug: corticosteroids], or [Procedure: immunosuppressive drugs].